Clinical trial exclusion criterion:
Women refusing HBs Ag test

Annotated entities:
- Measurement: "HBs Ag test"
- Negation: "refusing"